What are common variants at 12q14 and 12q24 associated with?

Common variants at 12q14 and 12q24 are associated with hippocampal volume.